Age 18 or older

The above is a clinical trial inclusion criterion. Annotated with entity spans:
[Person: Age] [Value: 18 or older]